No chemotherapy treatment (except for Deticene used before the first T cell clones infusion) or radiotherapy or immunotherapy in the last 4 weeks before infusion.

The above is a clinical trial inclusion criterion. Annotated with entity spans:
[Negation: No] [Procedure: chemotherapy] treatment ([Negation: except for] [Drug: Deticene] used [Temporal: before the first T cell clones infusion]) or [Procedure: radiotherapy] or [Procedure: immunotherapy] [Temporal: in the last 4 weeks before infusion].